Aged between 18-70 years

The above is a clinical trial inclusion criterion. Annotated with entity spans:
[Person: Aged] [Value: between 18-70 years]